Clinical trial exclusion criterion:
Moderate or severe endometriosis.

Annotated entities:
- Condition: "endometriosis"
- Qualifier: "severe"
- Qualifier: "Moderate"